Subjects undergoing treatment for type 2 diabetes

The above is a clinical trial inclusion criterion. Annotated with entity spans:
Subjects undergoing [Procedure: treatment] for [Condition: type 2 diabetes]